La tendencia a la explotación interpersonal y a sacar provecho de los demás para lograr sus propios objetivos, caracteriza al trastorno de personalidad:
1. Pasivo-agresivo.
2. Narcisista.
3. Dependiente.
4. Paranoide.

Respuesta correcta: 2. Narcisista.